張先生是一位末期的肺癌患者，胸部 X 光顯示兩側肺部皆為癌細胞所浸潤，只剩下很少正常充氣的肺組織。臨床上張先生有嚴重的呼吸困難，給予高流量的氧氣面罩（O2 mask）亦無法維持正常的血氧濃度。依照緩和照護的原則，您認為最佳的處理方式為何？
A. 取得家屬同意使用氣管插管
B. 減少鴉片類止痛藥（opioids），暫時不顧及病人的疼痛問題
C. 排除其他因素如貧血等之後，可以緩慢增加 narcotics，以減輕呼吸困難的症狀
D. 給予補救性的化學治療以緩慢癌症的進行

正確答案：C. 排除其他因素如貧血等之後，可以緩慢增加 narcotics，以減輕呼吸困難的症狀